Clinical trial exclusion criterion:
Patients with impaired cardiac function or clinically significant cardiac diseases.

Entity relations:
- Has_qualifier("cardiac diseases", "clinically significant")
- OR("impaired cardiac function", "cardiac diseases")